Clinical trial inclusion criterion:
retrospectively, with any significant change in motor function over at least one year, unrelated to relapse.

Annotated entities:
- Qualifier: "significant"
- Condition: "change in motor function"
- Temporal: "over at least one year"
- Qualifier: "unrelated to relapse"